La señora P. R. tiene prescrita sueroterapia a razón de 2 litros de solución salina isotónica en 24 horas; ¿a cuántas gotas/minuto graduaría la perfusión?:
1. 20.
2. 24.
3. 28.
4. 32.
5. 36.

Respuesta correcta: 3. 28.